Clinical trial exclusion criterion:
1. Orthopedic injuries that are unstable

Entity relations:
- Has_qualifier("Orthopedic injuries", "unstable")